Clinical trial inclusion criterion:
Hemoglobin greater than or equal to 7.5 g/dL

Annotated entities:
- Measurement: "Hemoglobin"
- Value: "greater than or equal to 7.5 g/dL"